Clinical trial exclusion criterion:
Previously received an allogeneic transplant.

Annotated entities:
- Procedure: "allogeneic transplant"